Patients with a calculated PRA higher than 0% per solid phase and / or anti-HLA class I and / or class II antibodies detectable by single antigen test (Luminex®).

The above is a clinical trial exclusion criterion. Annotated with entity spans:
Patients with a [Measurement: calculated PRA] [Value: higher than 0% per solid phase] and / or [Value: anti-HLA class I] and / or class II antibodies detectable by [Procedure: single antigen test] ([Procedure: Luminex]®).